依據 2008 年版赫爾辛基宣言（Declaration of Helsinki），在治療病人的過程中，若無有效的治療方法，倘若醫師判斷有希望挽救生命，重建健康或減輕痛苦，經那些程序後，得採用未經證實之治療方法？
A. 只需諮詢過專家
B. 只需取得病人或其法定代理人之同意書
C. 需諮詢過專家且取得病人或其法定代理人之同意書
D. 需諮詢過專家且取得病人或其法定代理人之同意書，並報經主管機關核准

正確答案：C. 需諮詢過專家且取得病人或其法定代理人之同意書